Severe chronic kidney disease (Stage 4 and 5)

The above is a clinical trial inclusion criterion. Annotated with entity spans:
[Qualifier: Severe] [Condition: chronic kidney disease] ([Condition: Stage 4] [Grammar_Error: and] 5)